Clinical trial exclusion criterion:
Thrombolytic therapy within 24 hours before randomization

Entity relations:
- Has_temporal("Thrombolytic therapy", "within 24 hours before randomization")
- Has_index("within 24 hours before randomization", "randomization")